Clinical trial exclusion criterion:
Patients with a history of allergic reactions to loxapine or amoxapine

Entity relations:
- AND("allergic reactions", "loxapine")
- OR("loxapine", "amoxapine")